Clinical trial exclusion criterion:
Patients with atrial fibrillation taking any anticoagulant therapy or patients with a history of cardioembolic ischemic stroke or hemorrhagic stroke.

Entity relations:
- Has_qualifier("ischemic stroke", "cardioembolic")
- Has_temporal("ischemic stroke", "history of")
- OR("ischemic stroke", "hemorrhagic stroke")
- OR("atrial fibrillation", "ischemic stroke")
- OR("anticoagulant therapy", "ischemic stroke")